Subject has clinically compromised vertebral bodies at the index level(s) due to any traumatic, neoplastic, metabolic, or infectious pathology.

The above is a clinical trial exclusion criterion. Annotated with entity spans:
Subject has [Condition: clinically compromised vertebral bodies] at the [Qualifier: index level(s)] due to any [Condition: traumatic], [Condition: neoplastic], [Condition: metabolic], or [Condition: infectious pathology].